La α-queratina consta de:
1. Dos hélices α dextrógiras enrolladas para formar una hélice levógira.
2. Dos hélices  dextrógiras enrolladas para formar una hélice levógira.
3. Dos hélices α levógiras enrolladas para formar una hélice levógira.
4. Dos hélices α levógiras enrolladas para formar una hélice dextrógira.
5. Una hélice α levógira y otra dextrógira enrolladas para formar una hélice levógira.

Respuesta correcta: 1. Dos hélices α dextrógiras enrolladas para formar una hélice levógira.